Clinical trial exclusion criterion:
Requirement for treatment with both ACEIs and ARBs.

Annotated entities:
- Drug: "ACEIs"
- Drug: "ARBs"
- Procedure: "treatment"
- Mood: "Requirement for"